68歲男性，長期使用多種藥物，最近發現在鼻、頰及耳部有藍灰色色素沉	，下列何種藥物，可能與其皮膚症狀相關？
A. amiodarone
B. aspirin
C. omeprazole
D. magnesium oxide

正確答案：A. amiodarone